Able to meet the extensive post-op evaluation regimen.

The above is a clinical trial inclusion criterion. Annotated with entity spans:
[Post-eligibility: Able to meet the extensive post-op evaluation regimen.]